下列那一種胰島素在人體內最快產生作用？
A. Regular insulin
B. NPH或lente
C. Lispro或aspart
D. Glargine

正確答案：C. Lispro或aspart